岡崎氏片段（Okazaki fragments）會在下列何種生物過程中出現？
A. 轉錄作用（transcription）
B. 轉譯作用（translation）
C. DNA 重組（DNA recombination）
D. DNA 複製（DNA replication）

正確答案：D. DNA 複製（DNA replication）